Adult males and females who are 18 years of age or older.

The above is a clinical trial inclusion criterion. Annotated with entity spans:
[Person: Adult] [Person: males] and [Person: females] who are [Value: 18 years of age or older].